Clinical trial inclusion criteria:
Subjects undergoing a single level lumbar decompression and fusion
> 18 years of age and < 70 years of age
The subject is willing and able to understand, sign and date the study specific patient informed consent and HIPAA authorization to volunteer participation in the study

Annotated entities:
- Procedure: "lumbar decompression"
- Procedure: "lumbar fusion"
- Qualifier: "single level"
- Person: "age"
- Value: "> 18 years and < 70 years"
- Post-eligibility: "The subject is willing and able to understand, sign and date the study specific patient informed consent and HIPAA authorization to volunteer participation in the study"